下列有關淋巴瘤（lymphoma）的敘述，何者錯誤？
A. 鼻 NK / T 細胞淋巴瘤與 EB 病毒有相當強的關聯
B. 大致而言，T 細胞淋巴瘤較 B 細胞淋巴瘤病程較嚴重，預後較差
C. B 細胞為 CD20 陽性，而 T 細胞為 CD3 陽性
D. 大多小孩的淋巴瘤為淋巴母細胞淋巴瘤（lymphoblastic lymphoma）及濾泡淋巴瘤（follicular lymphoma）

正確答案：D. 大多小孩的淋巴瘤為淋巴母細胞淋巴瘤（lymphoblastic lymphoma）及濾泡淋巴瘤（follicular lymphoma）